胸骨柄正中間處的穿刺傷，最可能傷及下列何者？
A. 主動脈弓（aortic arch）
B. 左心室（left ventricle）
C. 肺動脈幹（pulmonary trunk）
D. 上腔靜脈（superior vena cava）

正確答案：A. 主動脈弓（aortic arch）